下列有關E型肝炎之敘述，何者錯誤？
A. E型肝炎病毒主要是經口糞途徑傳染，潛伏期約24週
B. 感染急性E型肝炎患者，大多數預後良好，極少數患者感染後可能併發猛爆性肝衰竭（fulminant hepatic failure）
C. E型肝炎病毒IgM抗體（IgM anti-HEV）為診斷急性E型肝炎的血清標記
D. 感染急性E型肝炎之患者會完全痊癒，只有少數免疫功能嚴重受損之患者會演變成慢性E型肝炎

正確答案：A. E型肝炎病毒主要是經口糞途徑傳染，潛伏期約24週